Patient is either: refractory to medical treatment, contraindicated to medical treatment, OR refuses medical treatment

The above is a clinical trial inclusion criterion. Annotated with entity spans:
Patient is either: [Condition: refractory to medical treatment], [Condition: contraindicated to medical treatment], OR [Condition: refuses medical treatment]